Alanine aminotransferase (ALT) and aspartate aminotransferase (AST) ≤2.5 times the upper limit of normal if no liver involvement or ≤5 times the upper limit of normal with liver involvement.

The above is a clinical trial inclusion criterion. Annotated with entity spans:
[Measurement: Alanine aminotransferase (ALT)] and [Measurement: aspartate aminotransferase (AST)] [Value: ≤2.5 times the upper limit of normal] if [Negation: no] [Condition: liver involvement] or [Value: ≤5 times the upper limit of normal] with [Condition: liver involvement.]